Clinical trial exclusion criterion:
High bleeding risk; such as platelets <50,000 / mm3 during screening, Hb <8.5 g / dL, history of intracranial hemorrhage or subdural hematoma, major surgery, parenchymal organ biopsy or severe trauma within 30 days before inclusion, active gastrointestinal ulcer in the last 3 months;

Entity relations:
- Has_qualifier("bleeding risk", "High")
- Has_qualifier("trauma", "severe")
- Has_qualifier("gastrointestinal ulcer", "active")
- Has_value("platelets", "<50,000 / mm3")
- Has_value("Hb", "<8.5 g / dL")
- Has_temporal("intracranial hemorrhage", "within 30 days")
- Has_temporal("gastrointestinal ulcer", "last 3 months")
- Subsumes("bleeding risk", "platelets")
- OR("intracranial hemorrhage", "subdural hematoma", "major surgery,", "parenchymal organ biopsy", "trauma")
- OR("platelets", "Hb", "intracranial hemorrhage", "gastrointestinal ulcer")